6. Have a history of serious adverse gastrointestinal events (i.e., bleeding or perforation),history of a coagulopathy or current anti-coagulant use.

The above is a clinical trial exclusion criterion. Annotated with entity spans:
6. Have a [Temporal: history] of [Qualifier: serious] [Condition: adverse gastrointestinal events] (i.e., [Condition: bleeding] or [Condition: perforation]),[Temporal: history] of a [Condition: coagulopathy] or [Temporal: current] [Drug: anti-coagulant] use.